previous treatment with diuretics

The above is a clinical trial inclusion criterion. Annotated with entity spans:
[Temporal: previous] [Procedure: treatment] with [Drug: diuretics]